Clinical trial exclusion criterion:
Needs for co-administration of non-study antihypertensive agents or contraindicated medications during the study

Annotated entities:
- Temporal: "co-administration during the study"
- Qualifier: "non-study"
- Drug: "antihypertensive agents"
- Drug: "contraindicated medications"